En relación con el consumo de fibra dietética, es cierto que:
1. Debe ser equilibrado (25% soluble y 75% insoluble, aproximadamente).
2. A mayor consumo de fibra, debe reducirse la ingesta de agua.
3. Los productos hechos con semillas refinadas presentan un alto contenido en fibra.
4. Las legumbres son una fuente pobre de fibra.
5. En el adulto, se recomiendan 10-15 g de fibra diarios.

Respuesta correcta: 1. Debe ser equilibrado (25% soluble y 75% insoluble, aproximadamente).